Clinical trial inclusion criterion:
stable HbA1c (± 0.5%) for at least 12 weeks

Entity relations:
- Has_value("HbA1c", "± 0.5%")
- Has_temporal("± 0.5%", "at least 12 weeks")